關於第五頸髓損傷病患的呼吸系統的敘述，何者最正確？
A. 肺活量增加
B. 肺餘氣量（residual volume）下降
C. 呼氣能力比吸氣能力好
D. 容易發生肺擴張不全（atelectasis）

正確答案：D. 容易發生肺擴張不全（atelectasis）